Clinical trial inclusion criterion:
Forced expiratory volume (FEV1)< 30% predicted

Entity relations:
- Subsumes("Forced expiratory volume", "FEV1")
- Has_value("Forced expiratory volume", "< 30% predicted")